Clinical trial inclusion criterion:
STI (rectal or vaginal gonorrhea or syphilis) diagnosis during the last 6 months.

Annotated entities:
- Condition: "STI"
- Condition: "syphilis"
- Condition: "vaginal gonorrhea"
- Condition: "rectal gonorrhea"
- Temporal: "during the last 6 months"